一位 70 歲女性高血壓患者，心電圖顯示有心房顫動（atrial fibrillation），因突然嚴重腹痛 3 小時被送至急診，發作前她是在看電視。病人有噁心及嘔吐，但發作前數小時有正常排便。平常用藥有 hydrochlorothiazide、enalapril 及 digoxin。就診時血壓為 88/64 mmHg，心跳不規則，每分鐘約 120 次，體溫 38.5℃，腹部有壓痛，腸蠕動音降低（hypoactive bowel sound）。電腦斷層顯示脾臟附近腸壁水腫且有空氣，其他無特殊發現。在急診患者有少量排便，有含血反應。血清 amylase 及 lipase 只稍微增高，下列那一診斷方向最可能？
A. 急性胰臟炎
B. 大腸癌阻塞（colon cancer with obstruction）
C. 腸缺血（intestinal ischemia or mesenteric ischemia）
D. 十二指腸潰瘍穿孔（perforated duodenal ulcer）

正確答案：C. 腸缺血（intestinal ischemia or mesenteric ischemia）